Diagnosis of diabetes mellitus according to World Health Organization criteria ( treatment with insulin or an oral hypoglycemic agent, twice random glucose measurements major than 200 mg/dl, or a fasting glucose major than 140 mg/dl)

The above is a clinical trial inclusion criterion. Annotated with entity spans:
Diagnosis of [Condition: diabetes mellitus] according to [Qualifier: World Health Organization criteria] ( [Procedure: treatment] with [Drug: insulin] or an [Drug: oral hypoglycemic agent], [Multiplier: twice] [Measurement: random glucose measurements] [Value: major than 200 mg/dl], or a [Measurement: fasting glucose] [Value: major than 140 mg/dl])